Respecto a la síntesis de ácidos grasos:
1. No requiere bicarbonato.
2. Proporciona NADPH.
3. Los ácidos grasos se transportan al citosol mediante la carnitina.
4. Interviene la proteína portadora de acilo.

Respuesta correcta: 4. Interviene la proteína portadora de acilo.